一位 60 歲男性於喝酒 1 小時後昏迷，血液驗出甲醇（methanol），該物質喜好傷害何處的神經細胞？
A. 黑質（substantia nigra）
B. 橄欖核（olivary nucleus）
C. 視網膜（retina）
D. 視神經（optic nerve）

正確答案：C. 視網膜（retina）